嚴重外傷病患呈現腹內大量出血及休克時，有時必須採用傷害控制手術（damage control surgery）於短時間內來控制出血及其他搶救步驟，以挽救生命。否則會出現致死三元素（lethal triad）。下列何者不屬於lethal triad？
A. 凝血機能不全（coagulopathy）
B. 代謝性酸中毒（metabolic acidosis）
C. 低體溫（hypothermia）
D. 血症（sepsis）

正確答案：D. 血症（sepsis）